Clinical trial exclusion criterion:
A1C >7.0%

Annotated entities:
- Measurement: "A1C"
- Value: ">7.0%"